Clinical trial exclusion criteria:
Except for serious complications (cardiovascular events and recent significant liver, kidney or lung disease within 3 months)
high blood pressure (>160/100mmHg)
active infection
secondary diabetes
pregnancy
alcohol abuse
allergic to GLP-1 receptor agonist

Annotated entities:
- Condition: "serious complications"
- Condition: "cardiovascular events"
- Condition: "disease liver"
- Condition: "disease kidney"
- Condition: "lung disease"
- Temporal: "within 3 months"
- Qualifier: "significant"
- Condition: "high blood pressure"
- Value: ">160/100mmHg"
- Measurement: "blood pressure"
- Condition: "active infection"
- Qualifier: "secondary"
- Condition: "diabetes"
- Condition: "pregnancy"
- Condition: "alcohol abuse"
- Condition: "allergic"
- Drug: "GLP-1 receptor agonist"